Clinical trial exclusion criterion:
Need for a multiorgan transplantation

Entity relations:
- Has_mood("multiorgan transplantation", "Need for")